What is achalasia?

achalasia is a primary esophageal motility disorder